Significant hepatic or renal impairment (and/or alanine transaminase(ALT) or Aspartate transaminase(AST) >2 times upper limit of normal, creatinine clearance rate(CCr)<50%);

The above is a clinical trial exclusion criterion. Annotated with entity spans:
[Qualifier: Significant] [Condition: hepatic] or [Condition: renal impairment] (and/or [Measurement: alanine transaminase(ALT)] or [Measurement: Aspartate transaminase(AST)] [Value: >2 times upper limit of normal], [Measurement: creatinine clearance rate(CCr)][Value: <50%]);